Severe concomitant disease with life expectation < 1 year

The above is a clinical trial exclusion criterion. Annotated with entity spans:
[Condition: Severe] [Temporal: concomitant] disease with [Measurement: life expectation] [Value: < 1 year]